下面環境流行病學研究中常用的生態研究（ecological studies）之敘述何者錯誤？
A. 無法取得個人暴露資料
B. 非常容易控制干擾因子
C. 群體層次的關係不能推論到個體層次
D. 適合新領域研究，想以迅速並花費低的方式來尋求可能的假說

正確答案：B. 非常容易控制干擾因子